一名35歲女性因夜尿（nocturia）就診，身體檢查：血壓150/94 mmHg，脈搏78/min，其它檢查無異常。實 室檢	：blood urea nitrogen 15 mg/dL，creatinine 1.0 mg/dL，空腹血糖97 mg/dL，血鈉142 mmol/L，血鉀
 8 mmol/L，血氯90 mmol/L，尿沉渣正常，尿鉀排泄量50 mmol/day，動脈氣體pH 7.45，[HCO3-] 30 mmol/L，PaCO2 44 mmHg，則本病人最可能罹患？
A. 腎小管酸血症（renal tubular acidosis）
B. 巴特氏症候群（Bartter's syndrome）
C. 絨毛狀腺瘤（villous adenoma）
D. 原發性皮質醛酮症（primary aldosteronism）

正確答案：D. 原發性皮質醛酮症（primary aldosteronism）